1. PPROM with gestational age between 27 to 34 weeks

The above is a clinical trial inclusion criterion. Annotated with entity spans:
[Parsing_Error: 1.] [Condition: PPROM] with [Measurement: gestational age] [Value: between 27 to 34 weeks]